hypersensitivity to shrimps, lobsters or beetles

The above is a clinical trial exclusion criterion. Annotated with entity spans:
[Condition: hypersensitivity] to [Qualifier: shrimps], [Qualifier: lobsters] or [Qualifier: beetles]